Known hypersensitivity to any of the drugs given

The above is a clinical trial exclusion criterion. Annotated with entity spans:
Known [Condition: hypersensitivity] to any of the [Drug: drugs] given